What is the nucleotide composition of the Lamin Associated Domains (LADs)?

Instead, cLADs are universally characterized by long stretches of DNA of high A/T content. Analysis of paralogs suggests that during evolution changes in A/T content have driven the relocation of genes to and from the nuclear lamina, in tight association with changes in expression level. This suggests that the A/T rule represents a default positioning mechanism that is locally overruled during lineage commitment. Constitutive nuclear lamina-genome interactions are highly conserved and associated with A/T-rich sequence. Cell-type specific LADs also tend to adhere to this "A/T rule" in embryonic stem cells, but not in differentiated cells.